pregnancy or non-acceptance to use anticonception measures during 13 days after debut

The above is a clinical trial exclusion criterion. Annotated with entity spans:
[Pregnancy_considerations: pregnancy or non-acceptance to use anticonception measures during 13 days after debut]